Clinical trial inclusion criterion:
Ability of perform a maximal exercise test as defined by a respiratory exchange ratio (RER) greater than 1.0 at the time of maximal exercise

Entity relations:
- AND("Ability of perform", "maximal exercise test")
- Has_value("respiratory exchange ratio (RER)", "greater than 1.0")
- Has_qualifier("respiratory exchange ratio (RER)", "at the time of maximal exercise")
- Subsumes("Ability of perform", "respiratory exchange ratio (RER)")